Clinical trial inclusion criterion:
intact preoperative erectile function with an IIEF = 21 (IIEF-6).

Annotated entities:
- Condition: "intact erectile function"
- Temporal: "preoperative"
- Measurement: "IIEF"
- Value: "= 21"
- Observation: "IIEF-6"